Clinical trial inclusion criteria:
Age equal or greater than 70 years
Onset of symptoms < 3 hours prior to randomisation
= 2 mm ST-elevation across 2 contiguous precordial leads (V1-V6) or leads I and aVL for a minimum combined total of = 4 mm ST-elevation or
= 2 mm ST-elevation in 2 contiguous inferior leads (II, III, aVF) for a minimum combined total of = 4 mm ST-elevation
Informed consent received

Annotated entities:
- Person: "Age"
- Value: "equal or greater than 70 years"
- Observation: "Onset of symptoms"
- Temporal: "< 3 hours prior to randomisation"
- Reference_point: "randomisation"
- Non-query-able: "= 2 mm ST-elevation across 2 contiguous precordial leads (V1-V6) or leads I and aVL for a minimum combined total of = 4 mm ST-elevation"
- Non-query-able: "= 2 mm ST-elevation in 2 contiguous inferior leads (II, III, aVF) for a minimum combined total of = 4 mm ST-elevation"
- Informed_consent: "Informed consent received"